Macula edema secondary to BRVO

The above is a clinical trial inclusion criterion. Annotated with entity spans:
[Condition: Macula edema] secondary to [Condition: BRVO]